Clinical trial inclusion criterion:
Life expectancy 6 weeks or greater

Entity relations:
- Has_value("Life expectancy", "6 weeks or greater")